8歲女童，有一小腦囊性腫瘤（cystic tumor），腫瘤細胞為（gliofibrillary acidic protein, GFAP）陽性之毛狀星狀膠原細胞，細胞排列呈兩相型（biphasic pattern），下列敘述何者正確？
A. 腫瘤生長迅速
B. 同類腫瘤亦常見於老年人的大腦
C. 常見到羅森賽纖維（Rosenthal fibers）
D. 腫瘤細胞廣泛浸潤於周圍的腦組織

正確答案：C. 常見到羅森賽纖維（Rosenthal fibers）